一個 20 歲男學生，住宿舍，近日發現手指縫、腋下、腹部、大腿內側及陰囊發生劇癢性丘疹，於夜 晚蓋被時加劇。其室友也有同樣的情形。以下那種疾病最為可能？
A. 蕁麻疹（urticaria）
B. 疥瘡（scabies）
C. 蚊蟲咬（insect bite）
D. 痤瘡（acne）

正確答案：B. 疥瘡（scabies）